Clinical trial exclusion criterion:
At Visit 1, receiving ongoing treatment with a duration of more than 2 weeks with prednisone equivalent to >10mg/day

Entity relations:
- Has_multiplier("prednisone", ">10mg/day")
- Has_temporal("prednisone", "At Visit 1 more than 2 weeks")
- Has_index("At Visit 1 more than 2 weeks", "Visit 1")